IDU with report of using previously used or shared needles in past 6 months or has been in a methadone, buprenorphine, or suboxone treatment program in past 6 months or engaging in high-risk sexual behaviors

The above is a clinical trial inclusion criterion. Annotated with entity spans:
[Person: IDU] with report of [Observation: using previously used or shared needles] [Temporal: in past 6 months] or has been in a [Drug: methadone], [Drug: buprenorphine], or [Drug: suboxone] [Procedure: treatment program] [Temporal: in past 6 months] or [Observation: engaging in high-risk sexual behaviors]